Clinical trial inclusion criterion:
histologically diagnosed primary classical osteosarcoma in extremities

Entity relations:
- Has_qualifier("classical osteosarcoma", "in extremities")
- Has_qualifier("classical osteosarcoma", "primary")
- AND("histologically", "classical osteosarcoma")